下列何者不是治療末期腎病（ESRD）的腎臟替換治療（renal replacement therapy）？
A. hemodialysis
B. renal transplantation
C. hemoperfusion
D. CAPD（continuous ambulatory peritoneal dialysis）

正確答案：C. hemoperfusion